Open, video-assisted thoracoscopic or robotic surgeries

The above is a clinical trial inclusion criterion. Annotated with entity spans:
Open, [Qualifier: video-assisted] [Procedure: thoracoscopic] or [Procedure: robotic surgeries]